Clinical trial exclusion criterion:
(5)Known serious medical conditions, including: Cardiovascular: patients with clinically diagnosed cardiac dysfunction (NYHA class III and above), hypertrophic obstructive cardiomyopathy, clinically significant valvular heart disease, acute coronary syndrome within the last 3 months, or percutaneous coronary intervention (PCI), or coronary artery bypass graft (CABG); or abnormal pre-enrollment ECG test results with clinically significant arrhythmias (atrial flutter, atrial fibrillation, grade II-III atrioventricular block, etc.); Digestive: a previous diagnosis of various types of viral hepatitis that are still in the active phase; abnormal pre-enrollment liver function test results (ALT, AST, GGT, TBIL, or DBIL 3 times higher than normal, ALB = 30g/L); gastrectomy and/or gastrojejunostomy; gastrointestinal dysfunction; Urinary: pre-enrollment serum creatinine greater than 200umol/L; clinical diagnosis of renal artery stenosis, isolated kidney, kidney transplantation and/or other diseases; Endocrine: type 1 diabetes or uncontrolled type 2 diabetes (fasting blood glucose above 11.1 mmol/L at pre-enrollment); previous diagnosis of hyperthyroidism and failure to correct; Respiratory: pulmonary heart disease; chronic obstructive pulmonary disease; Neuropsychiatric: recent transient ischemic attack or stroke (within the last 3 months); peripheral or severe autonomic dysfunction; mental or nervous system dysfunction, inability to express desire; known drug or alcohol dependence; Malignancy, malnutrition, hematopoietic disorders and other serious diseases.

Annotated entities:
- Qualifier: "serious"
- Condition: "medical conditions"
- Condition: "cardiac dysfunction"
- Qualifier: "clinically diagnosed"
- Measurement: "NYHA class"
- Value: "III and above"
- Condition: "hypertrophic obstructive cardiomyopathy"
- Qualifier: "clinically significant"
- Condition: "valvular heart disease"
- Condition: "acute coronary syndrome"
- Temporal: "within the last 3 months"
- Procedure: "percutaneous coronary intervention (PCI)"
- Procedure: "coronary artery bypass graft (CABG)"
- Value: "abnormal"
- Temporal: "pre-enrollment"
- Measurement: "ECG test"
- Qualifier: "clinically significant"
- Condition: "arrhythmias"
- Condition: "atrial flutter"
- Condition: "atrial fibrillation"
- Condition: "atrioventricular block"
- Qualifier: "grade II"
- Qualifier: "grade III"
- Temporal: "previous"
- Condition: "viral hepatitis"
- Qualifier: "active phase"
- Value: "abnormal"
- Measurement: "liver function test"
- Temporal: "pre-enrollment"
- Measurement: "ALT"
- Measurement: "AST"
- Measurement: "GGT"
- Measurement: "TBIL"
- Measurement: "DBIL"
- Value: "3 times higher than normal"
- Measurement: "ALB"
- Value: "= 30g/L"
- Procedure: "gastrectomy"
- Procedure: "gastrojejunostomy"
- Condition: "gastrointestinal dysfunction"
- Temporal: "pre-enrollment"
- Measurement: "serum creatinine"
- Value: "greater than 200umol/L"
- Qualifier: "clinical diagnosis"
- Condition: "renal artery stenosis"
- Procedure: "kidney transplantation"
- Condition: "isolated kidney"
- Condition: "type 1 diabetes"
- Qualifier: "uncontrolled"
- Condition: "type 2 diabetes"
- Measurement: "fasting blood glucose"
- Value: "above 11.1 mmol/L"
- Temporal: "at pre-enrollment"
- Reference_point: "pre-enrollment"
- Temporal: "previous"
- Condition: "hyperthyroidism"
- Observation: "failure to correct"
- Condition: "pulmonary heart disease"
- Condition: "chronic obstructive pulmonary disease"
- Temporal: "recent"
- Condition: "transient ischemic attack"
- Condition: "stroke"
- Temporal: "within the last 3 months"
- Qualifier: "peripheral"
- Qualifier: "severe"
- Condition: "autonomic dysfunction"
- Condition: "mental system dysfunction"
- Condition: "nervous system dysfunction"
- Observation: "inability to express desire"
- Condition: "drug dependence"
- Condition: "alcohol dependence"
- Condition: "Malignancy"
- Condition: "malnutrition"
- Condition: "hematopoietic disorders"